GFR (MDRD) < 40 ml/min;

The above is a clinical trial exclusion criterion. Annotated with entity spans:
[Measurement: GFR] (MDRD) [Value: < 40 ml/min];